Malignancy(diagnosed or under investigation)

The above is a clinical trial exclusion criterion. Annotated with entity spans:
[Condition: Malignancy]([Mood: diagnosed] or [Mood: under investigation])